Coagulation disorders;

The above is a clinical trial exclusion criterion. Annotated with entity spans:
[Condition: Coagulation disorders];